依臺灣法律之規定，下列何種狀況下，醫師不負有通報主管機關之義務？
A. 醫師於急診發現具有自殺傾向之 A 女士長期受其丈夫虐打
B. 醫師於急診發現 B 女童被其父親遺棄
C. 醫師於進行心理治療時，發現精神科病人 C 揚言殺死其母親
D. 醫師於門診發現有人類免疫缺乏病毒（Human Immunodeficiency Virus）之感染者

正確答案：C. 醫師於進行心理治療時，發現精神科病人 C 揚言殺死其母親